Clinical trial exclusion criterion:
2. Man

Annotated entities:
- Parsing_Error: "2."
- Person: "Man"